Clinical trial inclusion criteria:
Clinical suspicion of Morton neuroma confirmed in ultrasound scan
Symptoms present more than six months
The thickness of the nerve must be at least 2 mm in short axis and at least 5 mm in the longitudinal axis.

Annotated entities:
- Condition: "Morton neuroma"
- Procedure: "ultrasound scan"
- Mood: "Clinical suspicion"
- Temporal: "more than six months"
- Condition: "Symptoms"
- Measurement: "thickness of the nerve in short axis"
- Value: "at least 2 mm"
- Value: "at least 5 mm"
- Measurement: "thickness of the nerve in the longitudinal axis"